Clinical trial inclusion criterion:
Age > 20 y/o.

Entity relations:
- Has_value("Age", "> 20 y/o")